Clinical trial exclusion criterion:
PCI/MI within the past 2 months (60 days)

Annotated entities:
- Condition: "MI"
- Procedure: "PCI"
- Temporal: "within the past 2 months"
- Temporal: "within the past 60 days"